La conversión en el ciclo de los ácidos tricarboxílicos del malato en oxalacetato es una reacción de:
1. Fosforilación.
2. Descarboxilación.
3. Deshidrogenación.
4. Reducción.

Respuesta correcta: 3. Deshidrogenación.